Clinical trial exclusion criterion:
major illness

Entity relations:
- Has_qualifier("illness", "major")